Señale la respuesta correcta. Atiende a Sara, una mujer de 36 años, que trabaja como profesora infantil, que ha sido diagnosticada de Diabetes Mellitus y que es madre de una niña de 18 meses, de la que es cuidadora principal. Durante el proceso de atención a Sara, usted la entrevista sobre aspectos como sus conocimientos sobre su cuidado, las habilidades desarrolladas para llevar a cabo acciones de cuidado y las motivaciones que van a hacer conseguir mantener los hábitos. Siguiendo el modelo de Orem, todo este conjunto de elementos que usted valora se conoce como:
1. Agencia de Autocuidado.
2. Factores Condicionantes Básicos.
3. Demanda de Autocuidado Terapéutico.
4. Requisitos de Autocuidado.

Respuesta correcta: 1. Agencia de Autocuidado.